Clinical trial exclusion criterion:
A history of cataract surgery complications/vitreous loss in the study eye.

Entity relations:
- multi("cataract surgery complications", "cataract surgery")
- Has_temporal("cataract surgery complications", "history of")
- Has_qualifier("cataract surgery complications", "in the study eye")
- OR("cataract surgery complications", "vitreous loss")